Clinical trial inclusion criterion:
Age18-65

Annotated entities:
- Person: "Age"
- Value: "18-65"